Clinical trial exclusion criterion:
Alcohol and other drug abuse cases based on 6 months before screening.

Annotated entities:
- Condition: "Alcohol abuse"
- Condition: "drug abuse"
- Temporal: "6 months before screening"